Clinical trial inclusion criterion:
Histologically confirmed diagnosis of melanoma, breast cancer or gynecologic cancer at MSKCC

Annotated entities:
- Condition: "melanoma"
- Procedure: "Histologically"
- Value: "confirmed"
- Condition: "breast cancer"
- Condition: "gynecologic cancer"
- Visit: "MSKCC"